Estudiante de historia de 24 años que a las tres semanas de un catarro de vías respiratorias altas acude al médico por sensación de acorchamiento en manos y pérdida de fuerza en extremidades en los últimos días. El cuadro se precedió de dolor lumbar. En la exploración destaca, disminución de fuerza muscular asimétrica en extremidades superiores e inferiores, pérdida de reflejos osteotendinosos. En este paciente el diagnóstico más probable es:
1. Miastenia gravis.
2. Primer brote de esclerosis múltiple.
3. Polirradiculopatía              desmielinizante inflamatoria aguda.
4. Dermatomiositis.
5. Esclerosis lateral amiotrófica.

Respuesta correcta: 3. Polirradiculopatía              desmielinizante inflamatoria aguda.